Clinical trial exclusion criterion:
Inability to use the PCA device.

Entity relations:
- AND("Inability", "use the PCA")